Smoking

The above is a clinical trial exclusion criterion. Annotated with entity spans:
[Condition: Smoking]